Clinical trial inclusion criterion:
Patients undergoing laparoscopic assisted donor nephrectomy

Annotated entities:
- Procedure: "laparoscopic assisted donor nephrectomy"